Clinical trial exclusion criterion:
HIV seropositivity

Entity relations:
- Has_value("HIV", "seropositivity")